下列何種藥品可用來治療偏頭痛，但因具有子宮收縮的作用，故懷孕的婦女不可使用，因易導致流產？
A. Indomethacin
B. Aspirin
C. Ergot alkaloids
D. Celecoxib

正確答案：C. Ergot alkaloids